漿細胞（plasma cell）內堆積大量免疫球蛋白，所形成的細胞內粉紅色物質，稱為：
A. Russell body
B. amyloid
C. Mallory-Denk body
D. psammoma body

正確答案：A. Russell body